Moderate to very severe lesions located in large folds

The above is a clinical trial inclusion criterion. Annotated with entity spans:
Moderate to [Qualifier: very severe] [Condition: lesions] located in large folds